Clinical trial exclusion criterion:
Women of Childbearing potential without proper contraceptive measures, pregnancy or breast feeding

Entity relations:
- Has_negation("contraceptive measures", "without")
- AND("Childbearing potential", "contraceptive measures")
- OR("Childbearing potential", "pregnancy", "breast feeding")